接受開心手術病人術前評估為風濕性瓣膜性疾病，其術前血壓為 170/35 mmHg，最可能是何種瓣膜疾病？
A. 主動脈瓣狹窄
B. 主動脈瓣閉鎖不全
C. 二尖瓣閉鎖不全
D. 二尖瓣狹窄

正確答案：B. 主動脈瓣閉鎖不全